0 meses previamente sano con gastroenteritis aguda de un día de evolución y signos de deshidratación leve, sin sangre ni moco en las heces y sin intolerancia oral. ¿Cuál es el tratamiento de elección inicial en nuestro medio?
1. Rehidratación intravenosa, dieta absoluta 8 horas y comenzar alimentación con dieta astringente.
2. Rehidratación con solución de rehidratación oral de baja osmolalidad (sodio 60-75 mEq/L) y continuar con su alimentación habitual.
3. Rehidratación con solución de rehidratación oral de baja osmolalidad (sodio 60-75 mEq/L), mantener alimentación habitual y amoxicilina oral 10 días.
4. Rehidratación con solución de rehidratación oral de baja osmolalidad (sodio 60-75 mEq/L) y comenzar alimentación con fórmula sin lactosa.
5. Rehidratación con solución de rehidratación oral de baja osmolalidad (sodio 60-75 mEq/L), mantener alimentación habitual y loperamida 7 días.

Respuesta correcta: 2. Rehidratación con solución de rehidratación oral de baja osmolalidad (sodio 60-75 mEq/L) y continuar con su alimentación habitual.